Which gene is associated with Muenke syndrome?

Muenke syndrome has been related to a mutation on the Fibroblast Growth Factor Receptor (FGFR3) gene.